一位 55 歲男性病患十天前因急性呼吸道感染導致肺炎，胸部 X 光片顯示擴散性、雙側和快速進展的間質性與肺泡性浸潤變化，經診斷已出現肺水腫（lung edema）和高二氧化碳血症（hypercapnia），下列何者不會出現在此病患？
A. 擴散（diffusion）障礙
B. 換氣／灌流異常（ventilation/perfusion mismatch）
C. 增加周邊組織中氧氣與血紅素的結合度
D. 體循環動脈氧分壓（PaO2）下降

正確答案：C. 增加周邊組織中氧氣與血紅素的結合度